Clinical trial exclusion criterion:
4. Past diagnosis of major depression, schizophrenia, major anxiety syndrome, or manic- depressive illness.

Entity relations:
- AND("Past diagnosis", "major depression")
- OR("major depression", "manic- depressive illness", "schizophrenia", "major anxiety syndrome")